Clinical trial inclusion criterion:
currently on hemodialysis at a CDC dialysis unit

Entity relations:
- AND("hemodialysis", "CDC dialysis unit")
- Has_temporal("hemodialysis", "currently")